Clinical trial exclusion criterion:
Patient with fever (38C or 100.4F)

Entity relations:
- Has_value("fever", "38C")
- OR("38C", "100.4F")